Clinical trial inclusion criteria:
Understand and communicate with the investigator, comply with the requirements of the study and give a written, signed and dated informed consent
Male or non-pregnant, non-lactating female patients at least 18 years of age
Diagnosis of moderate to severe Ankylosing Spondylitis (AS) with prior documented radiologic evidence fulfilling the Modified New York criteria for AS
Active AS assessed by total Bath Ankylosing Spondylitis Disease Activity index (BASDAI) = 4 (0-10) at baseline
Spinal pain as measured by BASDAI question #2 = 4 cm (0-10 cm) at baseline
Total back pain as measured by visual analog scale (VAS) = 40 mm (0-100 mm) at baseline
Patients should have been on non-steroidal anti-inflammatory drugs (NSAIDs) at the maximum tolerated dose for at least 4 weeks prior to their Baseline Visit, with an inadequate response or for less than 4 weeks if withdrawn for intolerance, toxicity or contraindications
Stable dose of NSAIDs including Cyclooxygenase-1 (COX-1) or Cyclooxygenase-2 (COX-2) inhibitors for at least 2 weeks before their Baseline Visit
Patients who have been on a tumor necrosis factor alpha (TNFa) inhibitor (not more than one) must have experienced an inadequate response to previous or current treatment given at an approved dose for at least 3 months prior to baseline or had been intolerant upon administration of an anti-TNFa agent
Total ankylosis of the spine
Use of other investigational drugs within 5 half-lives of enrollment, or within 4 weeks before the Baseline Visit, whichever is longer.
History of hypersensitivity to any of the study drugs or its excipients or to drugs of similar chemical classes.
Chest x-ray, computerized tomography (CT) scan, or chest magnetic resonance imaging (MRI) with evidence of ongoing infectious or malignant process, obtained within 3 months prior to screening and evaluated by a qualified physician.
Previous exposure to secukinumab or any other biologic drug directly targeting Interleukin-17 (IL-17), Interleukin-12/23 (IL-12/23), or the IL-17 receptor, or any other biologic immunomodulating agent, except those targeting TNFa
Patients who have taken more than one anti-TNFa agent
Any intramuscular or intravenous corticosteroid injection within 2 weeks before baseline
Any therapy by intra-articular injections (e.g. corticosteroid) within 4 weeks before baseline
Previous treatment with any cell-depleting therapies
Patients taking high potency opioid analgesics (e.g., methadone, hydromorphone, morphine)

Annotated entities:
- Informed_consent: "Understand and communicate with the investigator, comply with the requirements of the study and give a written, signed and dated informed consent"
- Pregnancy_considerations: "Male or non-pregnant, non-lactating female patients at least 18 years of age"
- Qualifier: "moderate"
- Qualifier: "severe"
- Condition: "Ankylosing Spondylitis (AS)"
- Condition: "radiologic evidence"
- Procedure: "radiologic"
- Temporal: "prior"
- Measurement: "Modified New York criteria for AS"
- Value: "fulfilling"
- Condition: "AS"
- Qualifier: "Active"
- Measurement: "total Bath Ankylosing Spondylitis Disease Activity index (BASDAI)"
- Value: "= 4"
- Temporal: "at baseline"
- Condition: "Spinal pain"
- Measurement: "BASDAI question #2"
- Value: "= 4 cm"
- Temporal: "at baseline"
- Measurement: "visual analog scale (VAS)"
- Value: "= 40 mm"
- Temporal: "at baseline"
- Condition: "Total back pain"
- Drug: "non-steroidal anti-inflammatory drugs (NSAIDs)"
- Multiplier: "maximum tolerated dose"
- Temporal: "for at least 4 weeks prior to their Baseline Visit"
- Reference_point: "their Baseline Visit"
- Condition: "inadequate response"
- Temporal: "for less than 4 weeks"
- Condition: "withdrawn for intolerance"
- Condition: "withdrawn for toxicity"
- Condition: "contraindications"
- Drug: "inhibitors Cyclooxygenase-1 (COX-1)"
- Drug: "Cyclooxygenase-2 (COX-2) inhibitors"
- Drug: "NSAIDs"
- Temporal: "for at least 2 weeks before their Baseline Visit"
- Reference_point: "their Baseline Visit"
- Drug: "tumor necrosis factor alpha (TNFa) inhibitor"
- Multiplier: "not more than one"
- Condition: "inadequate response"
- Multiplier: "approved dose"
- Temporal: "for at least 3 months prior to baseline"
- Procedure: "treatment"
- Temporal: "current"
- Temporal: "previous"
- Condition: "intolerant"
- Drug: "anti-TNFa agent"
- Condition: "Total ankylosis of the spine"
- Competing_trial: "Use of other investigational drugs within 5 half-lives of enrollment, or within 4 weeks before the Baseline Visit, whichever is longer."
- Condition: "hypersensitivity"
- Drug: "study drugs"
- Drug: "excipients"
- Drug: "drugs of similar chemical classes"
- Procedure: "Chest x-ray"
- Procedure: "computerized tomography (CT) scan"
- Procedure: "chest magnetic resonance imaging (MRI)"
- Temporal: "ongoing"
- Condition: "infectious"
- Condition: "malignant process"
- Temporal: "within 3 months prior to screening"
- Drug: "secukinumab"
- Drug: "biologic drug"
- Qualifier: "other"
- Drug: "Interleukin-17 (IL-17)"
- Condition: "targeting"
- Drug: "Interleukin-12/23 (IL-12/23)"
- Drug: "IL-17 receptor"
- Drug: "biologic immunomodulating agent"
- Negation: "except"
- Drug: "TNFa"
- Multiplier: "more than one"
- Drug: "anti-TNFa agent"
- Procedure: "corticosteroid injection"
- Qualifier: "intravenous"
- Qualifier: "intramuscular"
- Temporal: "within 2 weeks before baseline"
- Reference_point: "baseline"
- Procedure: "intra-articular injections"
- Drug: "corticosteroid"
- Temporal: "within 4 weeks before baseline"
- Procedure: "cell-depleting therapies"
- Temporal: "Previous"
- Drug: "high potency opioid analgesics"
- Drug: "methadone"
- Drug: "hydromorphone"
- Drug: "morphine"